Arrhythmia

The above is a clinical trial exclusion criterion. Annotated with entity spans:
[Condition: Arrhythmia]